The patients have no history of neoadjuvant hormone therapy.

The above is a clinical trial inclusion criterion. Annotated with entity spans:
The patients have [Negation: no history] of [Procedure: neoadjuvant hormone therapy].